Clinical trial inclusion criterion:
Mayo score (including sigmoidoscopy unless performed in previous 3 months)

Annotated entities:
- Procedure: "Mayo score"
- Procedure: "sigmoidoscopy"